Clinical trial exclusion criterion:
Patients who have undergone surgery within 24 hours prior to the study sonographic examination.

Entity relations:
- Has_index("within 24 hours prior to the study sonographic examination", "the study sonographic examination")
- AND("the study sonographic examination", "sonographic examination")
- Has_temporal("surgery", "within 24 hours prior to the study sonographic examination")